一位 22 歲女性，G0P0，主訴結婚 2 年未懷孕。病患身高 155 cm，體重 95 公斤，之前沒有任何手術史或內科病史。平常月經不規則，一年大約只有 4～5 次月經。綜合以上敘述，最有可能造成不孕的因素為何？
A. 子宮因素
B. 卵巢因素
C. 輸卵管因素
D. 子宮頸因素

正確答案：B. 卵巢因素